Subject has known cryoglobulinaemia. General exclusion criteria

The above is a clinical trial exclusion criterion. Annotated with entity spans:
Subject has known [Condition: cryoglobulinaemia]. General exclusion criteria